Understands the study procedure, alternatives, and risks and voluntarily agrees to participate by giving written informed concent

The above is a clinical trial inclusion criterion. Annotated with entity spans:
[Post-eligibility: Understands the study procedure, alternatives, and risks and voluntarily agrees to participate by giving written informed concent]